Clinical trial inclusion criterion:
≥18 years of age undergoing open-heart surgery (sternotomy, including minimally-invasive sternotomies)

Entity relations:
- Has_value("age", "≥18 years")
- Has_temporal("open-heart surgery", "undergoing")
- Subsumes("sternotomy", "minimally-invasive sternotomies")
- Subsumes("open-heart surgery", "sternotomy")